Clinical trial exclusion criteria:
incooperative for glucose monitor
refusal of insulin
pregnancy

Annotated entities:
- Procedure: "glucose monitor"
- Condition: "incooperative"
- Drug: "insulin"
- Condition: "refusal"
- Condition: "pregnancy"